某些特定先天性代謝異常疾病治療原則是飲食控制，以特殊配方奶粉而言，下列何種疾病是最無效的？
A. 半乳糖血症（galactosemia）
B. 典型苯酮尿症（phenylketonuria）
C. 典型高胱胺酸尿症（homocystinuria）
D. 葡萄糖-6-磷酸去氫酶（glucose-6-phosphate dehydrogenase）缺乏症

正確答案：D. 葡萄糖-6-磷酸去氫酶（glucose-6-phosphate dehydrogenase）缺乏症